Clinical trial exclusion criterion:
Breastfeeding or pregnant (intention to become) females or participation in other clinical trials

Annotated entities:
- Observation: "Breastfeeding"
- Condition: "pregnant"
- Person: "females"